Persistence of hCG is defined as at least 2 serial hCG values (over 2-14 days), showing < 15% rise per day, or < 50% fall between the first and last value.

The above is a clinical trial inclusion criterion. Annotated with entity spans:
[Condition: Persistence of hCG] is defined as [Multiplier: at least 2] serial [Measurement: hCG] values ([Temporal: over 2-14 days]), showing [Value: < 15% rise per day], or [Value: < 50% fall between the first and last value.]